Clinical trial exclusion criterion:
(7)Patients currently taking folate, B12, or B6, or any compounds containing them, who express an inability or a refusal to stop usage;

Annotated entities:
- Drug: "folate"
- Drug: "B12"
- Drug: "B6"
- Observation: "refusal to stop usage"
- Observation: "inability"
- Temporal: "currently"